Clinical trial exclusion criterion:
Treatment with antineoplastic or immunosuppressive drugs within 8 weeks prior to study inclusion

Annotated entities:
- Procedure: "Treatment"
- Drug: "antineoplastic drugs"
- Drug: "immunosuppressive drugs"
- Temporal: "within 8 weeks prior to study inclusion"
- Reference_point: "study inclusion"